Clinical trial exclusion criteria:
polycystic ovaries
untreated thyroid pathology
hypogonadotropic hypogonadism
untreaed hyperprolactinemia
study drug hypersensitivity
previous OHSS
unilateral ovariectomy
genital malformation
BMI>40

Annotated entities:
- Condition: "polycystic ovaries"
- Condition: "thyroid pathology"
- Qualifier: "untreated"
- Condition: "hypogonadotropic hypogonadism"
- Qualifier: "untreaed"
- Condition: "hyperprolactinemia"
- Condition: "hypersensitivity"
- Drug: "study drug"
- Condition: "OHSS"
- Temporal: "previous"
- Qualifier: "unilateral"
- Procedure: "ovariectomy"
- Condition: "genital malformation"
- Measurement: "BMI"
- Value: ">40"